Clinical trial inclusion criterion:
Able to complete the Evaluation to Sign Consent (ESC) with minimum score of 80%

Entity relations:
- Has_value("Evaluation to Sign Consent (ESC)", "minimum score of 80%")
- Has_context("Evaluation to Sign Consent (ESC)", "Able to complete")